Clinical trial exclusion criterion:
Patients who are unable or unwilling to give informed consent

Annotated entities:
- Non-query-able: "Patients who are unable or unwilling to give informed consent"